Patient with history of osteomyelitis/septic arthritis

The above is a clinical trial exclusion criterion. Annotated with entity spans:
Patient with history of [Condition: osteomyelitis][Parsing_Error: /][Condition: septic arthritis]